Which X chromosome abnormalities present lupus-like symptoms?

Lupus-like symptoms of systemic lupus erythematosus (SLE) are caused by X-linked mutations in the genes Tlr7 and Y.